Clinical trial exclusion criterion:
previous history of roux-en-y gastric bypass

Annotated entities:
- Temporal: "history"
- Procedure: "roux-en-y gastric bypass"
- Temporal: "previous"